兩種麻醉藥物死亡率差異的 95% 信賴區間為（-0.142, 0.102），若將檢定之顯	性水準由  05 更改為 0.01，其他條件不變下，檢定兩種麻醉藥物的死亡率是否有差異，下列敘述何者正確？
A. 兩種麻醉藥物的死亡率達統計顯
B. 兩種麻醉藥物的死亡率未達統計顯
C. 無法下結論
D. 此檢定的結果有可能犯下型一錯誤（type I error）

正確答案：B. 兩種麻醉藥物的死亡率未達統計顯